Clinical trial exclusion criterion:
Other investigational procedure <=30 days before study entry.

Entity relations:
- Has_qualifier("investigational procedure", "Other")
- Has_temporal("investigational procedure", "<=30 days before study entry")